Clinical trial exclusion criterion:
Significant renal dysfunction (see also exclusion criteria laboratory abnormalities).

Annotated entities:
- Qualifier: "Significant"
- Condition: "renal dysfunction"
- Non-representable: "(see also exclusion criteria laboratory abnormalities)"